Revisando la angio-TC de un hombre de 70 años en estudio por aneurisma de aorta abdominal el radiólogo informa de la presencia de una oclusión completa de la arteria mesentérica inferior.   El     paciente    se   encuentra completamente asintomático. La oclusión de la arteria mesentérica inferior cursa de manera asintomática en muchas ocasiones ya que el territorio que irriga puede recibir flujo proveniente de:
1. La arteria cólica media.
2. La arteria gastroduodenal.
3. La arteria epigástrica inferior izquierda.
4. La arteria esplénica.
5. La arteria gastroepiploica.

Respuesta correcta: 1. La arteria cólica media.